Clinical trial exclusion criterion:
Participation in another clinical trial within previous 30 days and/or anticipated participation in another trial during this study.

Annotated entities:
- Post-eligibility: "Participation in another clinical trial within previous 30 days and/or anticipated participation in another trial during this study."